Clinical trial exclusion criterion:
History of anti-vascular endothelial growth factor treatment in the past 12 months

Annotated entities:
- Drug: "anti-vascular endothelial growth factor"
- Temporal: "in the past 12 months"